一位 45 歲男性，有足癬，但無其他全身疾病史，無海水接觸史，於三天前右下肢開始產生紅、腫、痛，以及發燒、畏寒而被送到急診室，請問最常見之致病因？
A. 葡萄球菌
B. 創傷弧菌
C. 鏈球菌
D. 產氣單孢菌

正確答案：C. 鏈球菌